Clinical trial inclusion criterion:
The patient agrees to all protocol required follow-up intervals.

Annotated entities:
- Observation: "agrees to all protocol required follow-up intervals"
- Visit: "follow-up intervals"